55歲男性因右側顏面神經麻痺2～3週來診，耳鏡檢查發現右耳有耳漏，同時右耳後乳突處有壓痛。病史詢問得知患者過去有反覆右耳耳漏之情形，且右邊聽力不好，則最有可能的診斷為何？
A. Bell's顏面神經麻痺
B. 耳帶狀疱疹
C. 膽脂瘤引起之併發症
D. 顏面神經鞘瘤（facial nerve schwannoma）

正確答案：C. 膽脂瘤引起之併發症